一位 54 歲女性，甲狀腺腫大，約 1 年沒有心悸、怕熱，理學檢查甲狀腺稍硬，下一步檢查不必包括：
A. T3, TSH, T4
B. aspiration cytology
C. 超音波
D. CA-199

正確答案：D. CA-199